Clinical trial exclusion criterion:
Known intolerance to the doxycycline Body weight <40 kg Pregnancy or breastfeeding History of severe allergic reaction or anaphylaxis Alcohol or drug abuse

Entity relations:
- AND("intolerance to the doxycycline", "doxycycline")
- Has_value("Body weight", "<40 kg")
- Has_qualifier("allergic reaction", "severe")
- Has_temporal("allergic reaction", "History of")
- Has_temporal("Alcohol abuse", "History of")
- OR("intolerance to the doxycycline", "Pregnancy", "allergic reaction", "Body weight", "breastfeeding")
- OR("allergic reaction", "anaphylaxis")
- OR("Alcohol abuse", "drug abuse")